Clinical trial exclusion criterion:
Not available for follow-up

Annotated entities:
- Non-query-able: "Not available for follow-up"